Clinical trial exclusion criterion:
DSM-IV-TR substance-related disorders (except nicotine)

Annotated entities:
- Qualifier: "DSM-IV-TR"
- Condition: "substance-related disorders"
- Drug: "nicotine"
- Negation: "except"